手部手術大部分在局部麻醉下進行，下列麻醉劑何者不能使用？
A. Lidocaine 1%
B. Bupivacaine 0.25%
C. Lidocaine 1%加 Bupivacaine 0.25%
D. Lidocaine 1%加 norepinephrine

正確答案：D. Lidocaine 1%加 norepinephrine